對顏面位的胎兒而言，先露部（presenting part）是指：
A. 前頂（Sinciput）
B. 顴骨突起部（Malar eminence）
C. 頦部（Mentum）
D. 後頭部（Occiput）

正確答案：C. 頦部（Mentum）